Los linfocitos T   :
1. Tienen receptores antigénicos con regiones V invariantes.
2. Reconocen antígenos peptídicos asociados al Complejo Principal de Histocompatibilidad.
3. Tienen receptores antigénicos de diversidad antigénica muy variada.
4. Son especialmente abundantes en los tejidos epiteliales de ciertas especies.

Respuesta correcta: 4. Son especialmente abundantes en los tejidos epiteliales de ciertas especies.